Clinical trial inclusion criterion:
12. Willing to refrain from participation in any other research study for the duration of this study

Annotated entities:
- Post-eligibility: "Willing to refrain from participation in any other research study for the duration of this study"
- Non-query-able: "Willing to refrain from participation in any other research study for the duration of this study"